Clinical trial inclusion criterion:
Has no history of untreated latent or active tuberculosis (TB) prior to Screening

Entity relations:
- Has_qualifier("tuberculosis (TB)", "latent")
- Has_qualifier("tuberculosis (TB)", "untreated")
- Has_temporal("tuberculosis (TB)", "history")
- Has_negation("tuberculosis (TB)", "no")
- Has_index("prior to Screening", "Screening")
- Has_temporal("tuberculosis (TB)", "prior to Screening")
- OR("latent", "active")